一位中風後病患可講句子，對話語句順暢（fluent），但內容空洞，常併有亂語（paraphasia），無法覆誦（repetition），無法命名（naming）。請問此病患最可能之病變位置為何？
A. 額葉（frontal lobe）
B. 顳葉（temporal lobe）
C. 頂枕葉（parieto-occipital lobe）
D. 角廻（angular gyrus）

正確答案：B. 顳葉（temporal lobe）